台灣在 1960 年代曾在國際衛生的架構下，接受援助從事重要的衛生建設。下列敘述何者正確？
A. 曾經給予台灣協助的國際組織，都是聯合國或其所屬的機構，並沒有民間組織來台
B. 協助的事項包括根除瘧疾、防治結核病
C. 協助的事項包括撲滅鼠疫
D. 協助防治愛滋病

正確答案：B. 協助的事項包括根除瘧疾、防治結核病